Patients with thyroid pathology, the treatment of which has not been stabilized for at least three months.

The above is a clinical trial exclusion criterion. Annotated with entity spans:
Patients with [Condition: thyroid pathology], the [Procedure: treatment] of which has [Negation: not] been [Qualifier: stabilized] for [Temporal: at least three months].